Resting heart rate <45 bpm or >90 bpm at screening.

The above is a clinical trial exclusion criterion. Annotated with entity spans:
[Measurement: Resting heart rate] [Value: <45 bpm] or [Value: >90 bpm] [Temporal: at screening].